Women that underwent local radiation or chemotherapy within the last 12 months

The above is a clinical trial exclusion criterion. Annotated with entity spans:
[Person: Women] that underwent [Procedure: local radiation] or [Procedure: chemotherapy] [Temporal: within the last 12 months]